What is the generic name of the Xofluza?

Baloxavir marboxi is the generic name of Xofluza. It is approved for influenza.